Between which probes does the recurrent translocation breakpoint on chromosome 22 of neuroepithelioma lie?

The recurrent translocation breakpoint on chromosome 22 of neuroepithelioma has been localized between two probes, D22S1 and D22S15, by both in situ hybridization and somatic cell hybrids.